下列何者並非冠狀動脈疾病合併左心室瘤的外科適應症？
A. 充血性心臟衰竭
B. 感染性心內膜炎
C. 心絞痛
D. 心室性心律不整

正確答案：B. 感染性心內膜炎